居里（Curie）是下列那一種游離輻射的單位？
A. absorbed dose
B. equivalent dose
C. radioactivity
D. collective dose

正確答案：C. radioactivity